Clinical trial inclusion criterion:
HBV DNA < 200 IU/ml during nucleos(t)ide analogue (except Telbivudine) treatment within one month prior to initiation of peginterferon alfa-2a

Entity relations:
- Has_index("within one month prior to initiation of peginterferon alfa-2a", "initiation of peginterferon alfa-2a")
- AND("initiation of peginterferon alfa-2a", "peginterferon alfa-2a")
- Has_negation("Telbivudine", "except")
- Has_value("HBV DNA", "< 200 IU/ml")
- Has_index("during nucleos(t)ide analogue (except Telbivudine) treatment", "nucleos(t)ide analogue (except Telbivudine) treatment")
- Has_temporal("HBV DNA", "during nucleos(t)ide analogue (except Telbivudine) treatment")
- Has_temporal("HBV DNA", "within one month prior to initiation of peginterferon alfa-2a")